Clinical trial inclusion criterion:
Diagnosis of diabetes according ADA criteria:

Entity relations:
- Has_qualifier("diabetes", "ADA criteria")